Clinical trial exclusion criterion:
Clinically significant, uncontrolled cardiac arrhythmia, unstable angina, congestive heart failure (NYHA Class 3 or 4), or history of myocardial infarction in the preceding 2 years.

Entity relations:
- Has_qualifier("cardiac arrhythmia", "uncontrolled")
- Has_value("NYHA Class", "3")
- Has_temporal("myocardial infarction", "preceding 2 years")
- Subsumes("congestive heart failure", "NYHA Class")
- OR("3", "4")
- OR("cardiac arrhythmia", "unstable angina", "congestive heart failure", "myocardial infarction")